¿En qué tipo de hipoacusias es característico el fenómeno de reclutamiento o recruitment?
1. Hipoacusias de transmisión.
2. Hipoacusias mixtas.
3. Hipoacusias centrales.
4. Hipoacusias retrococleares.
5. Hipoacusias cocleares.

Respuesta correcta: 5. Hipoacusias cocleares.